Si evaluamos la personalidad partiendo de tres dimensiones: Extraversión/Introversión, Neuroticismo/Estabilidad y Psicoticismo/Control de impulsos, estamos tomando como base el modelo de:
1. R.B. Cattell.
2. H.J. Eysenck.
3. C.R. Cloninger.
4. J.B. Carroll.

Respuesta correcta: 2. H.J. Eysenck.